Clinical trial inclusion criterion:
1. Cognitive impairment from mild to moderate degree defined by a Clinical Deterioration Rating (CDR) score range between 0.5 and 2.0.

Entity relations:
- Has_value("Clinical Deterioration Rating (CDR) score", "range between 0.5 and 2.0")
- Has_qualifier("Cognitive impairment", "mild to moderate")